Clinical trial exclusion criterion:
Visual loss and/or serous detachment on OCT < 6 weeks;

Entity relations:
- AND("OCT", "Visual loss")
- Has_temporal("OCT", "< 6 weeks")
- OR("Visual loss", "serous detachment")